peripartum bleeding

The above is a clinical trial exclusion criterion. Annotated with entity spans:
[Condition: peripartum bleeding]